Familial hypercholesterolemia;

The above is a clinical trial exclusion criterion. Annotated with entity spans:
[Condition: Familial hypercholesterolemia];